Primary bone marrow failure;

The above is a clinical trial exclusion criterion. Annotated with entity spans:
[Condition: Primary bone marrow failure];